下列有關於facilitated diffusion之敘述，何者錯誤？
A. 需要carrier媒介
B. 會飽和
C. 對某些化合物具選擇性
D. 需消耗能量

正確答案：D. 需消耗能量